Hyperkalaemia

The above is a clinical trial inclusion criterion. Annotated with entity spans:
[Condition: Hyperkalaemia]